Adult men and women> 18 years old

The above is a clinical trial inclusion criterion. Annotated with entity spans:
[Person: Adult] [Person: men] and [Person: women][Value: > 18 years old]